Parkinson's disease with impulse Control disorder (ICD)

The above is a clinical trial exclusion criterion. Annotated with entity spans:
[Condition: Parkinson's disease] with [Condition: impulse Control disorder (ICD)]